Clinical trial inclusion criterion:
Bidimensional measurable disease

Annotated entities:
- Non-query-able: "Bidimensional measurable disease"